Clinical trial inclusion criterion:
For patients >=60 years of age: any 2 of the following:

Annotated entities:
- Value: ">=60 years"
- Person: "age"